Clinical trial exclusion criterion:
Younger than 18 years of age

Entity relations:
- Has_value("age", "Younger than 18 years")